關於猩紅熱的敘述，下列何者錯誤？
A. 為pyrogenic exotoxins引起
B. 感染後會出現脫皮的情形為A群鏈球菌引起
C. 治療首選藥物為紅黴素
D. 會呈現草莓舌、皮膚通紅

正確答案：C. 治療首選藥物為紅黴素